Clinical trial inclusion criterion:
If HBV DNA is positive, the subject is ineligible.

Entity relations:
- Has_value("HBV DNA", "positive")